Severe illness warranting hospital referral

The above is a clinical trial exclusion criterion. Annotated with entity spans:
[Qualifier: Severe] [Condition: illness] [Mood: warranting] [Procedure: hospital referral]